Hombre de 39 años de edad que en los 3 últimos meses ha tenido dos episodios de movimientos saltatorios amplios e involuntarios de miembros izquierdos, que en unos dos minutos llevan a pérdida de conciencia. En el estudio neurorradiológico se ha encontrado una lesión expansiva frontal derecha sugestiva de glioma cerebral. ¿Cómo clasificaría la epilepsia de este paciente?
1. Generalizada sintomática.
2. Parcial sintomática.
3. Parcial criptogénica.
4. Parcial secundariamente generalizada sintomática.

Respuesta correcta: 4. Parcial secundariamente generalizada sintomática.